Clinical trial exclusion criterion:
Subjects with known upper extremity deep vein thromboses (subclavian or distal)

Annotated entities:
- Condition: "upper extremity deep vein thromboses"
- Qualifier: "subclavian"
- Qualifier: "distal"